Clinical trial exclusion criterion:
Certain infectious endocarditis

Entity relations:
- Has_qualifier("infectious endocarditis", "Certain")